Clinical trial exclusion criterion:
History of significant psychiatric conditions that may affect patient assessment

Annotated entities:
- Non-query-able: "History of significant psychiatric conditions that may affect patient assessment"